Clinical trial exclusion criteria:
Pacing threshold(s) (at 0.4 or 0.5 ms) and/or sensing amplitude(s) and/or impedance(s) are not measurable
Meet one or more of the contraindications for MRI including Psychiatric disorders, anxiety, claustrophobia Cardiac disorders that represent a contraindication to MRI
Cardiac surgery already scheduled in the next three months
Have other medical implants that may interact with MRI, e.g. abandoned implantable cardioverter defibrillator (ICD) leads or pacemaker leads other than MRI conditional, lead extensions, other active medical devices, non-MRI compatible devices, mechanical valve
Have other metallic artifacts/components in body that may interact with MRI
Subjects for whom a single dose of 1.0 milligram (mg) dexamethasone acetate may be contraindicated
Subjects who require a legally authorized representative to obtain consent
Subjects who are immediate candidates for an ICD
Subjects with medical conditions that preclude the testing required by the protocol or limit study participation
Subjects who are enrolled or intend to participate in another clinical trial (of an investigational drug or device, new indication for an approved drug or device, or requirement of additional testing beyond standard clinical practice) during this clinical study
Being pregnant
Have a life expectancy of less than three months
Subjects with exclusion criteria required by local law (e.g. age, breastfeeding)

Annotated entities:
- Procedure: "Pacing threshold"
- Qualifier: "at 0.4 or 0.5 ms"
- Condition: "not measurable"
- Procedure: "sensing amplitude"
- Procedure: "impedance"
- Multiplier: "one or more"
- Condition: "contraindications"
- Procedure: "MRI"
- Condition: "Psychiatric disorders"
- Condition: "anxiety"
- Condition: "claustrophobia"
- Condition: "Cardiac disorders"
- Condition: "contraindication"
- Procedure: "MRI"
- Procedure: "Cardiac surgery"
- Mood: "scheduled"
- Temporal: "in the next three months"
- Reference_point: "three months"
- Device: "medical implants"
- Condition: "interact with MRI"
- Device: "abandoned implantable cardioverter defibrillator (ICD) leads"
- Device: "pacemaker leads"
- Negation: "other than"
- Device: "MRI conditional"
- Device: "lead extensions"
- Device: "active medical devices"
- Qualifier: "other"
- Device: "non-MRI compatible devices"
- Device: "mechanical valve"
- Device: "metallic artifacts"
- Device: "metallic components"
- Condition: "interact"
- Procedure: "MRI"
- Multiplier: "single"
- Multiplier: "dose of 1.0 milligram (mg)"
- Drug: "dexamethasone acetate"
- Condition: "contraindicated"
- Non-query-able: "Subjects who require a legally authorized representative to obtain consent"
- Temporal: "immediate"
- Mood: "candidates for"
- Procedure: "ICD"
- Condition: "medical conditions"
- Condition: "preclude"
- Procedure: "testing required by the protoco"
- Condition: "limit study participation"
- Non-query-able: "Subjects who are enrolled or intend to participate in another clinical trial (of an investigational drug or device, new indication for an approved drug or device, or requirement of additional testing beyond standard clinical practice) during this clinical study"
- Condition: "pregnant"
- Observation: "life expectancy"
- Value: "less than three months"
- Post-eligibility: "Subjects with exclusion criteria required by local law (e.g. age, breastfeeding)"